What is the function of STAR elements in yeast telomeres?

These elements were named STARs, for subtelomeric anti-silencing regions. Subtelomeres also contain Sub-Telomeric Anti-silencing Regions (STARs). We also show that the deletion of Histone-Acetyltransferase genes reduce the silencing activity of an ACS proto-silencer, but also reduce the anti-silencing activity of a STAR. In addition, an intervening STAR uncouples the silencing of neighboring genes.  The telomere-proximal portion of either X or Y' dampened silencing when located between the telomere and the reporter gene. STARs thus display the hallmarks of insulators.